Clinical trial exclusion criterion:
Concurrent terminal illness or other severe disease (e.g., active neoplasm) or other significant laboratory value(s) which, in the opinion of the investigator, could preclude participation or survival

Annotated entities:
- Temporal: "Concurrent"
- Condition: "terminal illness"
- Condition: "severe disease"
- Qualifier: "other"
- Qualifier: "active"
- Condition: "neoplasm"
- Procedure: "laboratory"
- Condition: "significant laboratory value(s)"
- Non-representable: "which, in the opinion of the investigator, could preclude participation or survival"
- Measurement: "laboratory"